Clinical trial exclusion criterion:
Received any vaccine within a month prior to study vaccine

Annotated entities:
- Procedure: "vaccine"
- Temporal: "within a month prior to study vaccine"
- Reference_point: "study vaccine"